Clinical trial exclusion criterion:
Subject has known intra-cardiac thrombus formation.

Annotated entities:
- Condition: "intra-cardiac thrombus"